¿Cuál de las siguientes técnicas de análisis multivariado analiza la covariación presentada por un conjunto de variables métricas, susceptibles de ser sintetizadas en un conjunto de factores comunes que subyacen tras ellas?
1. Análisis discriminante múltiple.
2. Regresión lineal múltiple.
3. Análisis multivariable de la varianza.
4. Análisis factorial.
5. Análisis de ecuaciones estructurales.

Respuesta correcta: 4. Análisis factorial.